D 型病毒性肝炎病毒是一有缺陷的病毒，無法單獨存在，它必須附於何種肝炎病毒才可能形成具傳染性之完整病毒？
A. A 型
B. B 型
C. C 型
D. E 型

正確答案：B. B 型